Previous anaphylaxis following any component of Bexsero vaccine

The above is a clinical trial exclusion criterion. Annotated with entity spans:
[Temporal: Previous] [Condition: anaphylaxis] following any component of [Drug: Bexsero vaccine]